Clinical trial exclusion criterion:
Evidence of abnormal liver function (serum ALT level(s) > 5 times upper limit of normal at screening or creatinine levels >2 times upper limit of normal at screening);

Annotated entities:
- Value: "abnormal"
- Measurement: "liver function"
- Measurement: "serum ALT level(s)"
- Value: "> 5 times upper limit of normal"
- Temporal: "at screening"
- Measurement: "creatinine levels"
- Value: ">2 times upper limit of normal"
- Temporal: "at screening"